醫護人員前往社區提供醫療服務，以下列那一種模式最具永續性？
A. 請鄰里長配合醫院已規劃好的工作
B. 挑選院內優秀醫師出國進修社區健康營造技術
C. 固定向政府爭取經費以補助社區的健康營造工作
D. 鼓勵社區組織志工團體並藉充能計畫強化其服務社區的能力

正確答案：D. 鼓勵社區組織志工團體並藉充能計畫強化其服務社區的能力